Clinical trial inclusion criterion:
Age 18 to 55 years old (inclusive) as of the date the ICF is signed

Annotated entities:
- Person: "Age"
- Value: "18 to 55 years old ("